Neurostimulation of which nucleus is used for treatment of dystonia?

Neurostimulation of globus pallidus internus is effective for treatment of dystonia. Ventral intermediate thalamic nucleus has also been tested for neurostimulation in dystonia patients.